下列副鼻竇（paranasal sinuses）何者因開口比較高，最容易因引流（drainage）不全而感染發炎？
A. 上頜竇（Maxillary sinus）
B. 額竇（Frontal sinus）
C. 蝶竇（Sphenoid sinus）
D. 篩竇（Ethmoidal sinus）

正確答案：A. 上頜竇（Maxillary sinus）